Which resource has been developed in order to study the transcriptional regulation of GABAergic cell fate?

Subpallial Enhancer Transgenic Lines is a data and tool resource to study transcriptional regulation of GABAergic cell fate.